下列何者為器官特異性的自體免疫疾病？
A. 全身性紅斑狼瘡（systemic lupus erythematosus）
B. 類風溼性關節炎（rheumatoid arthritis）
C. 多發性硬化症（multiple sclerosis）
D. 硬皮症（scleroderma）

正確答案：C. 多發性硬化症（multiple sclerosis）